Clinical trial exclusion criterion:
and any obvious infection or inflammation over a period of at least 1 month before the study.

Entity relations:
- Has_index("at least 1 month before the study", "study")
- Has_temporal("infection", "at least 1 month before the study")
- Has_qualifier("infection", "obvious")
- OR("infection", "inflammation")